Clinical trial inclusion criterion:
5. Be on stable dose of at least one of the following PAH-specific therapies: endothelin receptor antagonist, an agent acting on the nitric oxide pathway (phosphodiesterase type 5 inhibitor or soluble guanylate cyclase stimulator), and/or a prostacyclin or prostacyclin analog.

Entity relations:
- Subsumes("agent acting on the nitric oxide pathway", "phosphodiesterase type 5 inhibitor")
- Subsumes("PAH-specific therapies", "endothelin receptor antagonist")
- Has_multiplier("PAH-specific therapies", "at least one")
- Has_qualifier("PAH-specific therapies", "stable dose")
- OR("phosphodiesterase type 5 inhibitor", "soluble guanylate cyclase stimulator")
- OR("endothelin receptor antagonist", "agent acting on the nitric oxide pathway", "prostacyclin analog", "prostacyclin analog")